Type 1 diabetes mellitus

The above is a clinical trial exclusion criterion. Annotated with entity spans:
[Condition: Type 1 diabetes mellitus]